75歲具高中教育程度的男性病人，因高血壓及糖尿病的追踪治療前來就診，同時陳述最近一個月接連發生兩 次的跌倒，為他進行周全性老年評估，下列各類評估的敘述何者正確?
A. 需使用迷你心智狀態檢查（MMSE）進行心智狀態的評估，若得分在24分以下就屬於異常
B. 需使用老年憂鬱量表（GDS-15）來進行憂鬱症評估，若總分在4分以下為正常，超過8分就算有憂鬱症
C. 可使用迷你營養評估量表（MNA）來進行營養評估，若總分高於10分，表示可能有營養不良，需進一步提
D. 可使用巴氏量表來進行日常生活功能評估，若得分在31～60分屬於輕度失能

正確答案：A. 需使用迷你心智狀態檢查（MMSE）進行心智狀態的評估，若得分在24分以下就屬於異常